A la capacidad de captar los principios por los que se distingue entre lo que es moralmente bueno o malo se le denomina:
1. Acción moral.
2. Conciencia moral.
3. Libertad moral.
4. Ideal moral.
5. Capacidad moral.

Respuesta correcta: 2. Conciencia moral.